Clinical trial inclusion criterion:
1. Age ≥ 18 years

Annotated entities:
- Parsing_Error: "1."
- Person: "Age"
- Value: "≥ 18 years"